Clinical trial exclusion criterion:
History of immunodeficiency,

Entity relations:
- AND("History", "immunodeficiency")